Clinical trial exclusion criterion:
Myocardial damage, diabetic coma, heart block

Annotated entities:
- Condition: "Myocardial damage"
- Condition: "diabetic coma"
- Condition: "heart block"